Clinical trial exclusion criterion:
Terminal patient

Entity relations:
- Has_qualifier("patient", "Terminal")